Patient allergic to a penicillin or a carbapenem

The above is a clinical trial exclusion criterion. Annotated with entity spans:
Patient [Condition: allergic] to a [Drug: penicillin] or a [Drug: carbapenem]